Clinical trial exclusion criterion:
Patients with Impaired Renal Function with a have a known estimated CrCl<30 ml/min

Annotated entities:
- Condition: "Impaired Renal Function"
- Measurement: "estimated CrCl"
- Value: "<30 ml/min"